除了直腸泌尿道管外，先天性肛門還會合併其他泌尿道異常。下列何種情形最有可能合併泌尿道異常？
A. 低位無肛症（Low type imperforate anus）
B. 中位無肛症（Intermediate type imperforate anus）
C. 高位無肛症（High type imperforate anus）
D. 泄殖腔異常（Cloacal malformation）

正確答案：D. 泄殖腔異常（Cloacal malformation）